小腦的襻緣纖維（climbing fibers）主要徑行於下列何者？
A. 脊髓小腦前徑（anterior spinocerebellar tract）
B. 脊髓小腦後徑（posterior spinocerebellar tract）
C. 楔狀核小腦徑（cuneocerebellar tract）
D. 橄欖小腦徑（olivocerebellar tract）

正確答案：D. 橄欖小腦徑（olivocerebellar tract）